History of Stroke in the last 3 months;

The above is a clinical trial exclusion criterion. Annotated with entity spans:
[Temporal: History of] [Condition: Stroke] [Temporal: in the last 3 months];